30 min or more of moderate to vigorous activity more than 3 times per week

The above is a clinical trial exclusion criterion. Annotated with entity spans:
[Multiplier: 30 min or more] of [Observation: moderate to vigorous activity] [Multiplier: more than 3 times per week]